renal disease, as glomerular filtration rate (GFR) <60 ml/min/1,73 m*m

The above is a clinical trial exclusion criterion. Annotated with entity spans:
[Condition: renal disease], as [Measurement: glomerular filtration rate] ([Measurement: GFR]) [Value: <60 ml/min/1,73 m*m]